Presentation of suicidal ideation (= 3 on MADRS suicidal thoughts domain at time of study entry or at any time during study)

The above is a clinical trial inclusion criterion. Annotated with entity spans:
Presentation of [Condition: suicidal ideation] ([Value: = 3] on [Measurement: MADRS suicidal thoughts domain] [Temporal: at time of study entry] or [Temporal: at any time during study])